Clinical trial exclusion criterion:
Currently taking systemic steroids or other immunomodulatory medications including anticancer medications and antiviral medications

Entity relations:
- Subsumes("immunomodulatory medications", "anticancer medications")
- OR("systemic steroids", "immunomodulatory medications")
- OR("anticancer medications", "antiviral medications")